有關結核菌素引發之過敏反應的敘述，下列何者最正確？
A. IgE為主要參與反應的抗體
B. 由活化之T淋巴細胞主導
C. 常於接種結核菌素後半小時內發作
D. 發現有大量嗜酸性球浸潤

正確答案：B. 由活化之T淋巴細胞主導